Clinical trial exclusion criterion:
Prior therapy with VEGFR inhibitors such as sorafenib and sunitinib;

Annotated entities:
- Drug: "VEGFR inhibitors"
- Drug: "sorafenib"
- Drug: "sunitinib"